關於非結核分枝桿菌（nontuberculous mycobacteria）的治療，下列敘述何者最不適當？
A. 一旦確認為非結核分枝桿菌的感染，就必須立刻治療，避免疾病惡化
B. 通常治療非結核分枝桿菌肺部感染，都必須同時用多種藥物治療
C. Mycobacterium avium complex通常治療藥物包括macrolide（如clarithromycin）, ethambutol及rifamycin
D. Mycobacterium kansasii通常以isoniazid, rifampin及ethambutol治療

正確答案：A. 一旦確認為非結核分枝桿菌的感染，就必須立刻治療，避免疾病惡化